Inability to follow directions or comprehend the English language

The above is a clinical trial exclusion criterion. Annotated with entity spans:
[Observation: Inability to follow directions] or comprehend the English language